Clinical trial exclusion criterion:
Soft or hard contact lenses use during the last month from inclusion day

Entity relations:
- Has_index("during the last month from inclusion day", "inclusion day")
- Has_temporal("Soft contact lenses", "during the last month from inclusion day")
- OR("Soft contact lenses", "hard contact lenses")